Severe NC confounding conditions (stroke, head injury, or developmental learning disability).

The above is a clinical trial exclusion criterion. Annotated with entity spans:
Severe [Condition: NC confounding conditions] ([Condition: stroke], [Condition: head injury], or [Condition: developmental learning disability]).